10. Single vessel (single territory) disease.

The above is a clinical trial exclusion criterion. Annotated with entity spans:
10. [Condition: Single vessel] ([Condition: single territory]) disease.